Clinical trial exclusion criterion:
Patients with symptomatic orthostatic hypertension (the difference in the blood pressures between measured at supine position and measured at standing position is = 20 mmHg for siSBP and = 10 mmHg for siDBP)

Entity relations:
- Has_qualifier("orthostatic hypertension", "symptomatic")
- Has_value("siSBP", "= 20 mmHg")
- Has_value("siDBP", "= 10 mmHg")
- Has_qualifier("difference in the blood pressures", "measured at supine position and measured at standing position")
- AND("difference in the blood pressures", "siSBP")
- AND("difference in the blood pressures", "siDBP")
- Subsumes("orthostatic hypertension", "difference in the blood pressures")